Cytochrome p450 CYP3A is induced by rifampicin  and compounds used to treat what virus?

Four CYP3A inducers were used: rifampicin, rifabutin, carbamazepine, and efavirenz Etravirine is an effective and well-tolerated recently approved non-nucleoside reverse transcriptase inhibitor (NNRTI) for HIV type-1-infected patients with previous antiretroviral treatment experience.